10歲女童突發四肢無力至急診。血壓100/60 mmHg，血液檢查：肌酸酐（Creatinine）0.6 mg/dL，鉀離子為2.2 mmol/L，鈉離子為138 mmol/L，氯離子為96 mmol/L，鎂離子為1.3 mg/dL（正常值為1.6～2.4 mg/dL），血中 pH值為7.56，重碳酸根離子（HCO3-）為30 mmol/L。尿鈣與尿肌酸酐比值（Urine Ca/Cr）為0.1，女童最可能的診斷為：
A. 第一型腎小管酸血症（Renal tubular acidosis, type I）
B. 吉特曼症候群（Gitelman syndrome）
C. Bartter氏症候群（Bartter syndrome）
D. Fanconi症候群（Fanconi syndrome）

正確答案：B. 吉特曼症候群（Gitelman syndrome）